Patient is indicated to have an ocular refractive surgery performed (myopia, astigmatism, hypermetropy) by the Lasik method.

The above is a clinical trial inclusion criterion. Annotated with entity spans:
Patient is [Condition: indicated to have an ocular refractive surgery performed] ([Condition: myopia], [Condition: astigmatism], [Condition: hypermetropy]) by the [Qualifier: Lasik method].